Señale cuál de las siguientes opciones NO se corresponde con los objetivos de la medicación preanestésica:
1. Reducir la ansiedad.
2. Aliviar el dolor preoperatorio.
3. Aliviar el dolor postoperatorio.
4. Facilitar la inducción de la anestesia.
5. Reducir las necesidades de anestésico.

Respuesta correcta: 3. Aliviar el dolor postoperatorio.